Clinical trial exclusion criterion:
Subject has back or non-radicular leg pain of unknown etiology.

Annotated entities:
- Condition: "non-radicular leg pain"
- Condition: "back pain"
- Qualifier: "unknown etiology"